Clinical trial inclusion criterion:
Target ulcer area between 0.5 and 5 sqcm, and more than 4 weeks old.

Annotated entities:
- Measurement: "Target ulcer area"
- Value: "between 0.5 and 5 sqcm"
- Temporal: "more than 4 weeks old"